Clinical trial inclusion criterion:
Taking Clopidogrel 75 mg daily dose for at least 7 days or taking Clopidogrel 75 mg daily dose for less than 7 days but with 300 to 600 mg Clopidogrel loading dose before PCI.

Entity relations:
- multi("PCI", "PCI")
- Has_index("before PCI", "PCI")
- Has_multiplier("Clopidogrel", "300 to 600 mg")
- Has_temporal("Clopidogrel", "before PCI")
- Has_multiplier("Clopidogrel", "75 mg")
- Has_multiplier("Clopidogrel", "daily")
- Has_temporal("Clopidogrel", "for less than 7 days")
- Has_multiplier("Clopidogrel", "75 mg")
- Has_multiplier("Clopidogrel", "daily")
- Has_temporal("Clopidogrel", "for at least 7 days")
- OR("Clopidogrel", "Clopidogrel")